Clinical trial exclusion criteria:
Has previously received Dapsone therapy.
The subject or any of their healthcare providers is aware of the subjects HLA type.
Has been diagnosed with Glucose-6-phosphate dehydrogenase deficiency or methemoglobin reductase deficiency
Satisfies any contraindications or restrictions to Dapsone therapy as listed in the product labels.
Current severe illness, including heart, liver and renal failure, major organ allograft, malignancy requiring parenteral chemotherapy that can not be discontinued for the duration of the trial, or any other conditions which, in the opinion of the Investigator, would make the patient unsuitable for the study.
Any laboratory abnormality at Screening which, in the opinion of the Investigator, should preclude the subject's participation in the study [alanine aminotransferase (ALT), glutamic oxaloacetic transaminase(ALT), et al).
Pregnant women or women who are breastfeeding.
Subject is, in the opinion of the Investigator, unable to complete the 6 week Observation period and the EPT assessments as required.
A positive result for HLA-B*1301 in those subjects randomised to the genetic screening arm.

Annotated entities:
- Drug: "Dapsone"
- Non-query-able: "The subject or any of their healthcare providers is aware of the subjects HLA type"
- Condition: "Glucose-6-phosphate dehydrogenase deficiency"
- Condition: "methemoglobin reductase deficiency"
- Condition: "contraindications"
- Drug: "Dapsone"
- Condition: "renal failure"
- Condition: "liver failure"
- Condition: "heart failure"
- Condition: "major organ allograft"
- Condition: "malignancy"
- Procedure: "chemotherapy"
- Non-query-able: "Any laboratory abnormality at Screening which, in the opinion of the Investigator, should preclude the subject's participation in the study [alanine aminotransferase (ALT), glutamic oxaloacetic transaminase(ALT), et al)"
- Pregnancy_considerations: "regnant women or women who are breastfeeding"
- Non-query-able: "Subject is, in the opinion of the Investigator, unable to complete the 6 week Observation period and the EPT assessments as required"
- Measurement: "HLA-B*1301"
- Value: "positive"